Clinical trial inclusion criteria:
asthma or COPD

Annotated entities:
- Condition: "asthma"
- Condition: "COPD"